Clinical trial inclusion criterion:
Patients who have non muscle invasive bladder cancer male patients patients between 40-80 years old

Annotated entities:
- Condition: "non muscle invasive bladder cancer"
- Person: "old"
- Value: "between 40-80 years"
- Person: "male"